Clinical trial exclusion criterion:
For women, pregnancy, lactation, or unwillingness to comply with birth control requirements.

Annotated entities:
- Pregnancy_considerations: "For women, pregnancy, lactation, or unwillingness to comply with birth control requirements"